Clinical trial exclusion criterion:
Any medical condition requiring, or likely to require chronic systemic administration of steroids, during the course of the study

Entity relations:
- Has_qualifier("systemic steroids", "chronic")
- Has_temporal("systemic steroids", "during the course of the study")
- Has_index("during the course of the study", "course of the study")